Clinical trial inclusion criterion:
concomitant use of clopidogrel, or (9) Unwilling to accept random assignment of subjects

Entity relations:
- Has_temporal("clopidogrel", "concomitant")